Clinical trial exclusion criterion:
Treatment within the past 4 days with an antibiotic that may be effective against typhoid fever

Entity relations:
- Has_temporal("antibiotic", "within the past 4 days")
- Has_qualifier("antibiotic", "effective against typhoid fever")
- AND("effective against typhoid fever", "typhoid fever")